Clinical trial inclusion criterion:
WHO pulmonary hypertension function II-III with non-responder to calcium channel blockers.

Entity relations:
- Has_value("WHO pulmonary hypertension function", "II-III")
- multi("non-responder to calcium channel blockers", "calcium channel blockers")
- AND("WHO pulmonary hypertension function", "non-responder to calcium channel blockers")